某 22 歲男性，主訴下背與臀部疼痛，晨間有背部僵硬的感覺，下列何項抽血檢驗最具診斷價值？
A. Rheumatoid factor（RA）
B. Anti-nuclear antibody（ANA）
C. Uric acid
D. HLA B27

正確答案：D. HLA B27